Diabetes Type I and II

The above is a clinical trial exclusion criterion. Annotated with entity spans:
[Condition: Diabetes Type I] and II